¿Cuál es la edad de inicio más probable en la esquizofrenia?:
1. En la infancia.
2. Antes de los 12 años.
3. Final de la adolescencia o principios de edad adulta.
4. A cualquier edad.

Respuesta correcta: 3. Final de la adolescencia o principios de edad adulta.